Clinical trial exclusion criterion:
History of TBI more severe than mild by DVBIC criteria

Entity relations:
- Has_value("DVBIC criteria", "more severe than mild")
- AND("TBI", "DVBIC criteria")